下列何種頭痛有可能是自體顯性遺傳（autosomal dominant）？
A. 無預兆偏頭痛（migraine without aura）
B. 基底型偏頭痛（basilar migraine）
C. 偏癱性偏頭痛（hemiplegic migraine）
D. 緊縮型頭痛（tension headache）

正確答案：C. 偏癱性偏頭痛（hemiplegic migraine）